某癌症專科醫院鑑於近年來基因檢測日益普及，再加上人體組織資料庫有助於基因醫學的研究，因此決定在所有病人住院時，將許多的基因檢測納入常規檢查，所有病人都要自費做。有關這樣的作法，下列那一個說法錯誤？
A. 病人應該可以選擇是否做基因檢測，不應該未告知即納入常規檢查
B. 病人常規檢查剩餘的血液，如果要留存做研究，應該明確告知病人
C. 基因檢測結果的告知應提供基因諮詢
D. 基於促進醫學研究，醫院增列自費常規檢查項目並無不妥

正確答案：D. 基於促進醫學研究，醫院增列自費常規檢查項目並無不妥